有關右眼之外側視野訊息之敘述，何者正確？
A. 經由right optic nerve傳遞，在optic chiasm交叉，然後經由left optic tract傳至左側thalamus
B. 經由right optic nerve傳遞，在optic chiasm不交叉，然後經由right optic tract傳至右側thalamus
C. 經由right optic tract傳遞，在optic chiasm交叉，然後經由left optic radiation傳至左側thalamus
D. 經由right optic tract傳遞，在optic chiasm不交叉，然後經由right optic radiation傳至右側thalamus

正確答案：A. 經由right optic nerve傳遞，在optic chiasm交叉，然後經由left optic tract傳至左側thalamus